Clinical trial exclusion criterion:
Associated disease which could prevent patient from receiving treatment

Entity relations:
- Has_qualifier("Associated disease", "could prevent patient from receiving treatment")